Clinical trial inclusion criterion:
Have had one prior platinum-based chemotherapy regimen for the treatment of primary disease.

Entity relations:
- AND("primary disease", "platinum-based chemotherapy regimen")
- Has_temporal("platinum-based chemotherapy regimen", "prior")